Clinical trial inclusion criterion:
Person wears prosthesis daily and = 8 hours/day.

Annotated entities:
- Device: "prosthesis"
- Multiplier: "daily and = 8 hours/day"